關於兒童惡性肝腫瘤（malignant hepatic tumor）的敘述，下列何者最不恰當？
A. 肝母細胞癌（hepatoblastoma）主要發生在3歲以下的小孩，而肝細胞癌（hepatocellular carcinoma）的發病年齡較大
B. Beckwith-Wiedemann syndrome的患者，較易發生肝母細胞癌（hepatoblastoma）
C. 由於B 型肝炎疫苗的施打，已讓國內肝母細胞癌 （hepatoblastoma）發生率顯	下降，但肝細胞癌
D. 肝細胞癌（hepatocellular carcinoma）容易轉移至肺部，影響預後

正確答案：C. 由於B 型肝炎疫苗的施打，已讓國內肝母細胞癌 （hepatoblastoma）發生率顯	下降，但肝細胞癌